Primary valvular disease

The above is a clinical trial exclusion criterion. Annotated with entity spans:
[Condition: Primary valvular disease]